Clinical trial exclusion criterion:
Patients with clinically significant ventricular tachycardia, atrial fibrillation, atrial flutter or other clinically significant arrhythmia at the discretion of the investigator

Annotated entities:
- Qualifier: "clinically significant"
- Condition: "ventricular tachycardia"
- Condition: "atrial fibrillation"
- Condition: "atrial flutter"
- Qualifier: "clinically significant"
- Condition: "arrhythmia"